valid driver's license

The above is a clinical trial inclusion criterion. Annotated with entity spans:
[Observation: valid driver's license]